Clinical trial inclusion criterion:
Requirement of family or other caregiver support at study investigator criteria (defined as a patient's relative or caregiver (male or female) = 80 year old, who spend = 3 consecutive hours with patient, with good physical and psychological health status and without physical limitations, reading and writing educational level and able to understand and follow the study procedures).

Annotated entities:
- Non-query-able: "Requirement of family or other caregiver support at study investigator criteria (defined as a patient's relative or caregiver (male or female) = 80 year old, who spend = 3 consecutive hours with patient, with good physical and psychological health status and without physical limitations, reading and writing educational level and able to understand and follow the study procedures"